Clinical trial exclusion criterion:
Gallbladder's wall >3mm, atrophied gallbladder,gallstone obstruct the Hartmann's pouch.

Entity relations:
- Has_value("Gallbladder's wall", ">3mm")
- Has_qualifier("gallstone obstruct", "Hartmann's pouch")
- OR("Gallbladder's wall", "gallstone obstruct", "atrophied gallbladder")